那一種利尿劑會使病人血鉀增加？
A. spironolactone
B. bumetanide
C. acetazolamide
D. furosemide

正確答案：A. spironolactone